Clinical trial inclusion criterion:
Hematologic laboratory values as outlined in the protocol

Annotated entities:
- Non-representable: "Hematologic laboratory values as outlined in the protocol"
- Context_Error: "Hematologic laboratory values as outlined in the protocol"